La glucólisis y la gluconeogénesis hepática se regulan de modo recíproco por mecanismos hormonales facilitados, además de por un metabolito importante que determina si la glucosa debe ser sintetizada o degradada. ¿Cuál es?:
1. Fructosa 6-fostato.
2. Fructosa 1,6-bisfosfato.
3. Fructosa 2,6-bisfosfato.
4. Piruvato.
5. Lactato.

Respuesta correcta: 3. Fructosa 2,6-bisfosfato.